Clinical trial exclusion criterion:
Current pregnancy

Annotated entities:
- Condition: "pregnancy"